Clinical trial exclusion criterion:
Patients with severe anemia (hemoglobin <6g / dl), leukopenia (WBC <2500 / mm3) and / or thrombocytopenia (platelets <80,000 / mm3).

Annotated entities:
- Qualifier: "severe"
- Condition: "anemia"
- Measurement: "hemoglobin"
- Value: "<6g / dl"
- Condition: "leukopenia"
- Measurement: "WBC"
- Value: "<2500 / mm3"
- Condition: "thrombocytopenia"
- Measurement: "platelets"
- Value: "<80,000 / mm3"